Hepatitis B virus DNA not detectable(Roche Cobas).

The above is a clinical trial inclusion criterion. Annotated with entity spans:
[Measurement: Hepatitis B virus DNA] [Value: not detectable](Roche Cobas).